有一個 10 歲心智發育遲緩男孩，能自行負責日常起居，病人具短頭（Brachycephaly）、瞼裂較斜，並具明顯內眥贅皮摺，病人並有手掌斷掌紋，胸部理學檢查則顯示具有 Grade III/VI 之收縮性雜音。 此類病人在 40 歲時幾乎都會發生下列何種疾病？
A. 急性白血病
B. 肝硬化
C. 慢性腎衰竭
D. 阿滋海默氏病（Alzheimer's disease）

正確答案：D. 阿滋海默氏病（Alzheimer's disease）